Clinical trial exclusion criterion:
High amount of magnesium in blood

Entity relations:
- Has_value("magnesium in blood", "High amount")